Clinical trial inclusion criterion:
The potential postoperative visual acuity of 20/40 or better in both eyes;

Annotated entities:
- Non-query-able: "The potential postoperative visual acuity of 20/40 or better in both eyes;"